Clinical trial inclusion criteria:
Must have pathologically confirmed invasive adenocarcinoma or ductal carcinoma in situ of the breast.
Patients must have undergone segmental mastectomy (i.e., lumpectomy).
Patients must not have received prior radiation therapy to the breast.
Patients must not have active local-regional disease prior to registration.
Patients must not be pregnant because of the potential for fetal harm as a result of radiation treatment. Women of child-bearing age will be given a serum pregnancy test prior to study entry to ensure they are not pregnant. They will also be counseled on the importance of avoiding pregnancy and hormonal contraception while undergoing radiation therapy.
Patients must not have a serious medical or psychiatric illness which prevents informed consent or compliance with treatment.
All patients must be informed of the investigational nature of this study and give written informed consent in accordance with institutional and federal guidelines.

Annotated entities:
- Procedure: "pathologically"
- Value: "confirmed"
- Condition: "invasive adenocarcinoma"
- Condition: "ductal carcinoma in situ"
- Qualifier: "of the breast"
- Procedure: "segmental mastectomy"
- Procedure: "lumpectomy"
- Procedure: "radiation therapy"
- Negation: "not"
- Condition: "local-regional disease"
- Undefined_semantics: "local-regional disease"
- Temporal: "active"
- Negation: "not"
- Pregnancy_considerations: "Patients must not be pregnant because of the potential for fetal harm as a result of radiation treatment. Women of child-bearing age will be given a serum pregnancy test prior to study entry to ensure they are not pregnant. They will also be counseled on the importance of avoiding pregnancy and hormonal contraception while undergoing radiation therapy."
- Post-eligibility: "Patients must not have a serious medical or psychiatric illness which prevents informed consent or compliance with treatment."
- Post-eligibility: "All patients must be informed of the investigational nature of this study and give written informed consent in accordance with institutional and federal guidelines."